¿Qué dieta debe administrarse a los pacientes con una encefalopatía hepática crónica?:
1. Hipoproteica e hiposódica.
2. Hiperproteica e hiposódica.
3. Hiperproteica e hipercalórica.
4. Hipercalórica y suplementos de vitamina C.

Respuesta correcta: 1. Hipoproteica e hiposódica.